Clinical trial exclusion criterion:
having experienced severe allergies, trauma history and/or operation history within 3 months.

Entity relations:
- Has_qualifier("allergies", "severe")
- Has_temporal("trauma", "history")
- Has_temporal("operation", "history")
- Has_temporal("allergies", "within 3 months")
- OR("allergies", "operation", "trauma")